Clinical trial exclusion criterion:
Blood glucose < 50 mg/dL (2.7mmol/L);

Entity relations:
- Subsumes("< 50 mg/dL", "2.7mmol/L")
- Has_value("Blood glucose", "< 50 mg/dL")